What is the role of TNF in obesity?

TNF, acting via its receptors, is a major contributor to obesity-associated insulin resistance.